Clinical trial inclusion criteria:
women undergoing IVF/ICSI or frozen embryo transfers (FET) that less than 40 years old.

Annotated entities:
- Person: "women"
- Procedure: "IVF"
- Procedure: "ICSI"
- Procedure: "frozen embryo transfers (FET)"
- Value: "less than 40 years"
- Person: "old"